Clinical trial exclusion criterion:
5. Use of hormonal contraception (estrogen and progestin) within 3 months of study entry, or anticipated need to initiate estrogen-containing hormonal contraception during the study period

Annotated entities:
- Procedure: "hormonal contraception"
- Drug: "estrogen"
- Drug: "progestin"
- Temporal: "within 3 months of study entry"
- Reference_point: "study entry"
- Observation: "anticipated need"
- Procedure: "estrogen-containing hormonal contraception"
- Drug: "estrogen"
- Qualifier: "estrogen-containing"
- Temporal: "during the study period"
- Reference_point: "the study period"